What is the basis of the methidiumpropyl-EDTA sequencing (MPE-seq) method?

The methidiumpropyl-EDTA sequencing (MPE-seq) method uses a GpC methyltransferase (M. CviPI) and next generation sequencing to generate a high resolution footprint of nucleosome structure using less than 1 million cells while retaining endogenous DNA fragments from the same DNA strand.